關於無結石性急性膽囊炎的敘述，下列何者錯誤？
A. 因無膽結石，故症狀較結石引起之急性膽囊炎輕微，預後亦較佳
B. 多發生於重病或重傷患，可能與膽囊缺血或膽汁滯留有關
C. 約占所有急性膽囊炎之 5～10%
D. 大多須進行緊急膽囊切除術

正確答案：A. 因無膽結石，故症狀較結石引起之急性膽囊炎輕微，預後亦較佳